乳房外側的淋巴液回流至下列何者？
A. 腋淋巴結
B. 胸骨旁淋巴結
C. 橫膈下淋巴結
D. 對側乳房的淋巴結

正確答案：A. 腋淋巴結